Women who are pregnant (as evidenced by pregnancy test if pre-menopausal)

The above is a clinical trial exclusion criterion. Annotated with entity spans:
[Pregnancy_considerations: Women who are pregnant (as evidenced by pregnancy test if pre-menopausal)]